Clinical trial exclusion criterion:
The following concomitant medications are not allowed from 7 days prior to the first dose of study drug and during venetoclax administration: Strong CYP3A4 inhibitors including but not limited to fluconazole, ketoconazole, and clarithromycin or strong CYP3A4 inducers included but not limited to rifampin, carbamazepine.

Entity relations:
- Subsumes("strong CYP3A4 inducers", "rifampin")
- Subsumes("Strong CYP3A4 inhibitors", "fluconazole")
- Has_index("7 days prior", "first dose of study drug")
- AND("7 days prior", "Strong CYP3A4 inhibitors")
- Subsumes("strong CYP3A4 inducers", "carbamazepine")
- Subsumes("Strong CYP3A4 inhibitors", "ketoconazole")
- Subsumes("Strong CYP3A4 inhibitors", "clarithromycin")
- OR("Strong CYP3A4 inhibitors", "strong CYP3A4 inducers")
- OR("7 days prior", "venetoclax administration")